Clinical trial inclusion criteria:
At the cluster level, ED physicians practicing at a participating site will be eligible.
At the patient level, all hip fractures seen by a participating ED physician will be eligible

Annotated entities:
- Non-query-able: "At the cluster level, ED physicians practicing at a participating site will be eligible."
- Context_Error: "At the cluster level"
- Parsing_Error: "At the cluster level"
- Condition: "hip fracture"
- Non-query-able: "seen by a participating ED physician will be eligible"
- Context_Error: "At the patient level"
- Parsing_Error: "At the patient level"